Cancer or other significant co-morbidities implying that the patient's condition is unstable.

The above is a clinical trial exclusion criterion. Annotated with entity spans:
[Condition: Cancer] or other significant [Condition: co-morbidities] implying that the patient's condition is unstable.